下列何種因子不會導致內生性胰島素（endogenous insulin）的分泌？
A. Glucose
B. Glucagon
C. Somatostatin
D. Gastrin

正確答案：C. Somatostatin